Clinical trial inclusion criterion:
Congestive heart failure

Annotated entities:
- Condition: "Congestive heart failure"